Clinical trial exclusion criterion:
Known human immunodeficiency virus (HIV) positive

Annotated entities:
- Measurement: "human immunodeficiency virus"
- Measurement: "HIV"
- Value: "positive"